Clinical trial exclusion criterion:
Presence or history of thromboembolic disease as judged by the investigator

Annotated entities:
- Subjective_judgement: "as judged by the investigator"
- Parsing_Error: "Presence or history"
- Condition: "thromboembolic disease"